Clinical trial inclusion criterion:
Able to Extubate

Entity relations:
- Has_mood("Extubate", "Able to")